Clinical trial inclusion criteria:
1. Subject has a history of GTC seizures, either primary GTC or partial onset seizures with secondary generalization.
2. Is being admitted to a hospital for routine vEEG monitoring related to seizures.
3. Male or female between the ages of 2-99.
4. Has an upper arm circumference which is adequate for proper fit of the EMG monitor (at least 14cm).
5. If female and of childbearing potential, has a negative pregnancy test.
6. Can understand and sign written informed consent, or will have a parent or a legally authorized representative (LAR) who can do so, prior to the performance of any study assessments.
7. Subject and/or Primary Caregiver must be competent to follow all study procedures.
8. Is able to read, speak, and understand English.

Annotated entities:
- Parsing_Error: "1."
- Condition: "GTC seizures"
- Condition: "primary GTC"
- Condition: "partial onset seizures"
- Condition: "secondary generalization"
- Temporal: "history"
- Parsing_Error: "2."
- Procedure: "vEEG monitoring"
- Condition: "seizures"
- Procedure: "admitted to a hospital"
- Parsing_Error: "3."
- Person: "female"
- Person: "Male"
- Person: "the ages"
- Value: "between 2-99"
- Parsing_Error: "4."
- Measurement: "upper arm circumference"
- Qualifier: "adequate for proper fit of the EMG monitor"
- Undefined_semantics: "adequate for proper fit of the EMG monitor"
- Value: "at least 14cm"
- Parsing_Error: "5."
- Condition: "childbearing potential"
- Person: "female"
- Measurement: "pregnancy test"
- Value: "negative"
- Parsing_Error: "6."
- Post-eligibility: "Can understand and sign written informed consent, or will have a parent or a legally authorized representative (LAR) who can do so, prior to the performance of any study assessments."
- Non-query-able: "Can understand and sign written informed consent, or will have a parent or a legally authorized representative (LAR) who can do so, prior to the performance of any study assessments."
- Parsing_Error: "7."
- Post-eligibility: "Subject and/or Primary Caregiver must be competent to follow all study procedures."
- Non-query-able: "Subject and/or Primary Caregiver must be competent to follow all study procedures"
- Parsing_Error: "8."
- Non-query-able: "Is able to read, speak, and understand English."